Clinical trial inclusion criteria:
Diagnosed with cutaneous vasculitis, urticaria, psoriasis, acne, bullous skin diseases, sterile pustulosis, leprosy, pneumocystis pneumonia and any other patients who need dapsone administration.
Subjects are dapsone-naive.
All subjects must have a clinical need for treatment with dapsone that precedes the decision to participate in the study.
All subjects are willing to complete the 6-weeks period clinical trial.
All subjects are written informed consent.

Annotated entities:
- Condition: "cutaneous vasculitis"
- Condition: "urticaria"
- Condition: "psoriasis"
- Condition: "acne"
- Condition: "bullous skin diseases"
- Condition: "sterile pustulosis"
- Condition: "leprosy"
- Condition: "pneumocystis pneumonia"
- Drug: "dapsone"
- Drug: "dapsone"
- Negation: "naive"
- Non-query-able: "All subjects must have a clinical need for treatment with dapsone that precedes the decision to participate in the study"
- Post-eligibility: "All subjects are willing to complete the 6-weeks period clinical trial"
- Informed_consent: "All subjects are written informed consent"